1. Deny to sign the informed consent;

The above is a clinical trial exclusion criterion. Annotated with entity spans:
1. [Post-eligibility: Deny to sign the informed consent;]